Which is the most common type of pediatric cerebellar tumor?

Medulloblastoma is the most common malignant cerebellar tumor seen in the pediatric age group, which has a known ability to metastasize extraneurally.